5. Subject has clinical evidence of ischemic heart disease in terms of a positive functional study, or documented symptoms.

The above is a clinical trial inclusion criterion. Annotated with entity spans:
5. Subject has [Observation: clinical evidence] of [Condition: ischemic heart disease] in terms of a [Value: positive] [Procedure: functional study], or documented symptoms.